Need to continue clopidogrel due to stroke, peripheral disease, significant carotid disease or recent acute coronary syndrome

The above is a clinical trial exclusion criterion. Annotated with entity spans:
[Mood: Need to] [Multiplier: continue] [Drug: clopidogrel] due to [Condition: stroke], [Condition: peripheral disease], [Qualifier: significant] [Condition: carotid disease] or [Temporal: recent] [Condition: acute coronary syndrome]